有關良性乳房腫瘤，下列敘述何者正確？
A. 均應切除避免轉換成惡性
B. 腫瘤超過兩公分即應切除
C. 粗針切片病理為纖維囊腫變化（fibrocystic change）應切除
D. 粗針切片病理為非典型腺管增生（atypical ductal hyperplasia）應切除

正確答案：D. 粗針切片病理為非典型腺管增生（atypical ductal hyperplasia）應切除